The score of the sixth item of HAMA =3

The above is a clinical trial exclusion criterion. Annotated with entity spans:
The [Measurement: score of the sixth item of HAMA] [Value: =3]